GOLD 2: 0.50=FEV1<0.80 and FEV1/FVC < 0.70

The above is a clinical trial inclusion criterion. Annotated with entity spans:
[Measurement: GOLD] [Value: 2]: [Value: 0.50=][Measurement: FEV1]<0.80 and [Measurement: FEV1/FVC] [Value: < 0.70]